Clinical trial exclusion criterion:
allergies to medications used in the study

Entity relations:
- Has_qualifier("medications", "used in the study")
- AND("allergies", "medications")